影響胃排空（gastric empty）速率的因素，下列何者錯誤？
A. 熱量含量
B. 營養成分
C. 鹽分含量
D. 食物固態或液態

正確答案：C. 鹽分含量